Clinical trial inclusion criterion:
Patient is either: refractory to medical treatment, contraindicated to medical treatment, OR refuses medical treatment

Annotated entities:
- Condition: "refractory to medical treatment"
- Condition: "contraindicated to medical treatment"
- Condition: "refuses medical treatment"